Clinical trial inclusion criterion:
Subject demonstrating an IIEF-5 drug-free baseline score that is = 10 but = 16, and an IIEF-5 tadalafil-alone baseline score that is = 18

Annotated entities:
- Measurement: "IIEF-5 drug-free baseline score"
- Value: "= 10 but = 16"
- Measurement: "IIEF-5 tadalafil-alone baseline score"
- Value: "= 18"